Failure to provide informed consent

The above is a clinical trial exclusion criterion. Annotated with entity spans:
[Non-query-able: Failure to provide informed consent]